Clinical trial exclusion criterion:
Known acute pericarditis and/or subacute bacterial endocarditis

Entity relations:
- OR("acute pericarditis", "subacute bacterial endocarditis")